Gestational age >33 weeks at time of delivery

The above is a clinical trial inclusion criterion. Annotated with entity spans:
[Measurement: Gestational age] [Value: >33 weeks] [Temporal: at time of delivery]